Clinical trial inclusion criterion:
The patient must be insured or beneficiary of a health insurance plan

Annotated entities:
- Non-query-able: "The patient must be insured or beneficiary of a health insurance plan"